Patient not accepting polysomnography and multiple sleep latency test

The above is a clinical trial exclusion criterion. Annotated with entity spans:
Patient [Mood: not accepting] [Procedure: polysomnography] and [Procedure: multiple sleep latency test]